Clinical trial exclusion criterion:
Renal insufficiency with estimated creatinine clearance <30 ml/min/1.73m2

Annotated entities:
- Condition: "Renal insufficiency"
- Measurement: "estimated creatinine clearance"
- Value: "<30 ml/min/1.73m2"